Clinical trial inclusion criterion:
Adult subjects aged 18 years or older

Entity relations:
- Has_value("aged", "18 years or older")
- AND("Adult", "aged")